一名剛出生的男嬰，其腹部 X光的影像顯示有double-bubble sign，最可能的診斷為何？
A. 幽門狹窄（pyloric stenosis）
B. 十二指腸閉鎖（duodenal atresia）
C. 小腸閉鎖（intestinal atresia）
D. 肛門閉鎖（imperforate anus）

正確答案：B. 十二指腸閉鎖（duodenal atresia）